Clinical trial inclusion criteria:
19-65 years of age
ASA physical status classification I or II
Scheduled for total hip replacement surgery

Annotated entities:
- Value: "19-65 years"
- Person: "age"
- Measurement: "ASA physical status classification"
- Value: "I or II"
- Procedure: "total hip replacement surger"
- Mood: "Scheduled for"